Clinical trial inclusion criterion:
Active AS assessed by total Bath Ankylosing Spondylitis Disease Activity index (BASDAI) = 4 (0-10) at baseline

Entity relations:
- Has_value("total Bath Ankylosing Spondylitis Disease Activity index (BASDAI)", "= 4")
- Has_temporal("total Bath Ankylosing Spondylitis Disease Activity index (BASDAI)", "at baseline")
- Has_qualifier("AS", "Active")
- AND("AS", "total Bath Ankylosing Spondylitis Disease Activity index (BASDAI)")